Clinical trial inclusion criterion:
Presence of at least 2 cryopreserved good quality cleavage-stage embryo (good quality cleavage-stage embryos display stage-specific cell division, have blastomeres of fairly equal size with few to no cytoplasmic fragments).

Annotated entities:
- Multiplier: "at least 2"
- Qualifier: "cryopreserved"
- Qualifier: "good quality"
- Observation: "cleavage-stage embryo"
- Qualifier: "good quality"
- Observation: "cleavage-stage embryos"
- Qualifier: "stage-specific cell division"
- Qualifier: "have blastomeres of fairly equal size"
- Qualifier: "few to no cytoplasmic fragments"